History of decompensated cirrhosis (defined as jaundice in the presence of cirrhosis, ascites, bleeding gastric or esophageal varices or encephalopathy)

The above is a clinical trial exclusion criterion. Annotated with entity spans:
History of [Qualifier: decompensated] [Condition: cirrhosis] (defined as [Condition: jaundice] in the presence of [Condition: cirrhosis], [Condition: ascites], [Condition: bleeding gastric] or [Condition: esophageal varices] or [Condition: encephalopathy])